Clinical trial inclusion criterion:
moderate to severe Crohn's Disease (basic HBI = 7) with stenosis

Annotated entities:
- Qualifier: "moderate to severe"
- Condition: "Crohn's Disease"
- Measurement: "basic HBI"
- Value: "= 7"
- Condition: "stenosis"